一老年女性跌倒，造成股骨頸骨折（fracture of femoral neck）並傷及鄰近構造時，下列何者最不可能發生？
A. 大腿極度外展（abduction）
B. 股神經（femoral nerve）斷裂
C. 內旋股動脈（medial circumflex femoral artery）斷裂
D. 股骨頭韌帶（ligament of head of femur）斷裂

正確答案：B. 股神經（femoral nerve）斷裂